History of prostate, bladder, or rectal cancer

The above is a clinical trial exclusion criterion. Annotated with entity spans:
History of [Condition: prostate], [Condition: bladder], or [Condition: rectal cancer]